年輕男性的攝護腺，其中所占比例最多的是：
A. 移行區（transition zone）
B. 周邊區（peripheral zone）
C. 中央區（central zone）
D. 精阜及輸精管（verumontanum and ejaculatory duct）

正確答案：B. 周邊區（peripheral zone）